The patient is determined by a board certified neurosurgeon to have a tumor or vascular lesion that would take up fluorescein

The above is a clinical trial inclusion criterion. Annotated with entity spans:
The patient is determined by a board certified neurosurgeon to have a [Condition: tumor] or [Condition: vascular lesion] that [Qualifier: would take up fluorescein]